Clinical trial inclusion criterion:
Serum bilirubin less than or equal to 1.5 x institutional upper limit of normal (ULN)

Entity relations:
- Has_value("Serum bilirubin", "less than 1.5 x institutional upper limit of normal (ULN)")
- OR("less than 1.5 x institutional upper limit of normal (ULN)", "equal to 1.5 x institutional upper limit of normal (ULN)")